Clinical trial exclusion criterion:
History of: craniotomy, cerebral metastases, cerebrovascular accident; current diagnosis of seizure disorder, schizophrenia, schizo-affective disorder, dementia, mental retardation, or major depression with psychotic features; or use of depot neuroleptics in last 12 months.

Entity relations:
- Has_temporal("depot neuroleptics", "in last 12 months")
- AND("major depression", "psychotic features")
- Has_temporal("craniotomy", "History")
- OR("craniotomy", "cerebral metastases", "mental retardation", "major depression", "dementia", "schizo-affective disorder", "schizophrenia", "seizure disorder", "depot neuroleptics", "cerebrovascular accident")